Clinical trial exclusion criterion:
Contraindication for IR-MPH use

Annotated entities:
- Condition: "Contraindication"
- Drug: "IR-MPH"